Clinical trial exclusion criterion:
Known or suspected illicit drug or alcohol abuse

Annotated entities:
- Condition: "illicit drug abuse"
- Condition: "alcohol abuse"